一位 50 歲女性病人，主訴 2 個月來體重下降 3 公斤，理學檢查發現甲狀腺結節性腫大，無壓痛。實驗室檢查結果為 free T4 3.2 ng/dL（參考值 0.6-1.75），TSH＜0.001 μU/mL（參考值 0.1-4.5）。甲狀腺超音波發現左葉有一個 1 公分大小低回音度的結節，懷疑可能有惡性變化。最適當的立即處理方式為下列那一項？
A. 手術切除甲狀腺
B. 給予抗甲狀腺藥物
C. 放射性碘治療
D. 給予化學治療

正確答案：B. 給予抗甲狀腺藥物